Hombre de 55 años que consulta por disfonía. En la anamnesis refiere llevar un mes con astenia y pérdida de peso no cuantificada. La radiografía de tórax presenta un aumento de densidad en lóbulo superior izquierdo y ocupación de la ventana aorto-pulmonar. La broncoscopia constata una parálisis de la cuerda vocal izquierda, sin imagen endoscópica sugestiva de neoplasia. ¿Cuál es el diagnóstico más probable?:
1. Neoplasia pulmonar.
2. Sarcoidosis.
3. Silicosis.
4. Tuberculosis.

Respuesta correcta: 1. Neoplasia pulmonar.